Untreated severe comorbid psychiatric or somatic illness.

The above is a clinical trial exclusion criterion. Annotated with entity spans:
[Qualifier: Untreated] [Qualifier: severe] [Qualifier: comorbid] psychiatric or [Condition: somatic illness].